正確分辨Calot's triangle是降低腹腔鏡膽囊切除手術併發症的重要關鍵，其構成邊界不含下列何項？
A. 總肝管（common hepatic duct）
B. 膽囊管（cystic duct）
C. 膽囊動脈（cystic artery）
D. 肝臟邊緣（liver edge）

正確答案：C. 膽囊動脈（cystic artery）